Clinical trial exclusion criteria:
advanced chronic disease that would not allow the patient to complete the treatment or follow-up or attend visits
allergy to any of the drugs used in this study
previous Helicobacter Pylori eradication treatment
pregnancy or breastfeeding (female participants with childbearing potential were required to use medically accepted contraception for the duration of the study)
taking antibiotics or PPIs or bismuth salts within four weeks
previous gastrointestinal surgery

Annotated entities:
- Non-query-able: "dvanced chronic disease that would not allow the patient to complete the treatment or follow-up or attend visits"
- Non-representable: "allergy to any of the drugs used in this study"
- Procedure: "Helicobacter Pylori eradication treatment"
- Pregnancy_considerations: "pregnancy or breastfeeding (female participants with childbearing potential were required to use medically accepted contraception for the duration of the study)"
- Drug: "antibiotics"
- Drug: "PPIs"
- Drug: "bismuth salts"
- Temporal: "within four weeks"
- Procedure: "gastrointestinal surgery"